Clinical trial inclusion criterion:
At least 70 yrs old

Entity relations:
- Has_value("old", "At least 70 yrs")